La validez de contenido de un instrumento de evaluación se refiere a:
1. Las evidencias obtenidas mediante análisis factoriales.
2. La concurrencia de medidas.
3. La adecuación en el establecimiento de inferencias.
4. La relevancia y la representatividad de sus ítems.
5. Las relaciones significativas con otras medidas.

Respuesta correcta: 4. La relevancia y la representatividad de sus ítems.